Clinical trial inclusion criterion:
Temp >38,0 °C or <36,0 °C

Entity relations:
- Has_value("Temp", ">38,0 °C")
- OR(">38,0 °C", "<36,0 °C")